Clinical trial exclusion criteria:
diabetes mellitus
secondary hypertension
pregnancy

Annotated entities:
- Condition: "diabetes mellitus"
- Condition: "secondary hypertension"
- Condition: "pregnancy"